下列何者不是細胞凋亡（apoptosis）的特徵？
A. DNA 片段化
B. 凋亡小體形成
C. 細胞膜疱狀化（blebbing）
D. 細胞腫脹

正確答案：D. 細胞腫脹